Patients with a history (= 12 months) of acute coronary syndrome receiving dual antiplatelet therapy, or patients receiving monotherapy with aspirin.

The above is a clinical trial exclusion criterion. Annotated with entity spans:
Patients with a [Temporal: history] ([Temporal: = 12 months]) of [Condition: acute coronary syndrome] receiving [Procedure: dual antiplatelet therapy], or patients receiving [Procedure: monotherapy] with [Drug: aspirin].